Clinical trial inclusion criterion:
Be on a stable regimen of antiparkinson's medications at least 30 days prior to screening, and be expected to remain on a stable dose for the duration of the study.

Annotated entities:
- Drug: "antiparkinson's medications"
- Temporal: "at least 30 days prior to screening"
- Reference_point: "screening"